Post-operative complication of an act of neurosurgery or programmed neuroradiology

The above is a clinical trial inclusion criterion. Annotated with entity spans:
[Condition: Post-operative complication] [Qualifier: of an act of neurosurgery] or programmed [Procedure: neuroradiology]